En disoluciones reales, la actividad:
1. Tiene unidad de presión.
2. Puede ser negativa.
3. De un compuesto puro es 0.
4. Es adimensional.

Respuesta correcta: 4. Es adimensional.